Desde el punto de vista del crecimiento microbiano, ¿cuál de las siguientes afirmaciones es verdadera en relación al término colonia?
1. Es una formación no visible macroscópicamente.
2. Corresponde a una única célula.
3. Deriva de una sola célula.
4. Se forma habitualmente en medio de cultivo líquido.
5. Siempre está formada por la agregación de distintas especies microbianas.

Respuesta correcta: 3. Deriva de una sola célula.